下列何種細胞一般不被歸類為先天免疫細胞？
A. macrophage
B. B cell
C. neutrophil
D. dendritic cell

正確答案：B. B cell